presenting good health conditions

The above is a clinical trial inclusion criterion. Annotated with entity spans:
presenting [Condition: good health conditions]